2005 年初在中國安徽省等地爆發之流行性腦膜炎，證實為 C 型菌株所引起。此菌的分型是根據下列何種抗原？
A. 脂多糖體（lipopolysaccharides）
B. 莢膜多糖體（capsular polysaccharides）
C. 脂蛋白（lipoproteins）
D. 胜肽聚糖（peptidoglycans）

正確答案：B. 莢膜多糖體（capsular polysaccharides）